在檢查骨髓和軟組織的腫塊時，何項檢查最合適？
A. 電腦斷層掃描檢查
B. 磁振造影檢查
C. 一般 X 光檢查
D. 骨骼同位素掃描檢查

正確答案：B. 磁振造影檢查